has a history of food allergy

The above is a clinical trial exclusion criterion. Annotated with entity spans:
has a [Temporal: history] of [Condition: food allergy]